Which disease is Dasatinib used to treat?

Patients with chronic myeloid leukemia